Clinical trial exclusion criterion:
With any acute coronary syndrome complicated with acute pulmonary edema, cardiogenic shock and / or malignant ventricular arrhythmias.

Entity relations:
- Has_qualifier("ventricular arrhythmias", "malignant")
- AND("acute coronary syndrome", "acute pulmonary edema")
- OR("acute pulmonary edema", "cardiogenic shock", "ventricular arrhythmias")